Clinical trial exclusion criterion:
4. Baseline ejection fraction ≤ 50% as assessed by echocardiogram or MUGA.

Entity relations:
- Has_value("ejection fraction", "≤ 50%")
- Has_temporal("ejection fraction", "Baseline")
- AND("ejection fraction", "echocardiogram")
- OR("echocardiogram", "MUGA")